parturient in labour without cervical dilation and regular uterine contractions

The above is a clinical trial inclusion criterion. Annotated with entity spans:
[Person: parturient] in [Procedure: labour] [Negation: without] [Procedure: cervical dilation] and [Condition: regular uterine contractions]